Clinical trial inclusion criterion:
Anti-GAD antibodies negative (Glutamic Acid Decarboxylase)

Annotated entities:
- Measurement: "Anti-GAD antibodies (Glutamic Acid Decarboxylase)"
- Value: "negative"